Clinical trial inclusion criteria:
valid driver's license
english-speaking and literate

Annotated entities:
- Observation: "valid driver's license"
- Observation: "english-speaking"
- Observation: "literate"